Clinical trial exclusion criterion:
Complicating health factors precluding the use of opioids or acetaminophen

Annotated entities:
- Condition: "precluding"
- Drug: "opioids"
- Drug: "acetaminophen"
- Condition: "Complicating health factors"